Clinical trial inclusion criterion:
Subject understands and is willing, able, and likely to comply with study procedures and restrictions.

Annotated entities:
- Non-query-able: "Subject understands and is willing, able, and likely to comply with study procedures and restrictions."